Clinical trial exclusion criterion:
Clinically significant bleeding within the last 30 days.

Entity relations:
- Has_qualifier("bleeding", "Clinically significant")
- Has_temporal("bleeding", "within the last 30 days")